有關「抽象思考」，下列敘述何者錯誤？
A. 可以詢問「看電影時發生火災，您該怎麼辦？」來加以評估
B. 可以詢問成語「長江後浪推前浪」的意涵來加以評估
C. 思覺失調症（schizophrenia）患者可能會有抽象思考障礙
D. 失智症患者可能會有抽象思考障礙

正確答案：A. 可以詢問「看電影時發生火災，您該怎麼辦？」來加以評估